Patient greater than age 16 years

The above is a clinical trial exclusion criterion. Annotated with entity spans:
Patient [Value: greater than] [Person: age] 16 years